Clinical trial inclusion criterion:
HbA1c = 6,5 % or fasting glycemia =7mmol/l or non-fasting glycemia =11mmol/l

Entity relations:
- Has_value("HbA1c", "= 6,5 %")
- Has_value("fasting glycemia", "=7mmol/l")
- Has_value("non-fasting glycemia", "=11mmol/l")
- OR("HbA1c", "fasting glycemia", "non-fasting glycemia")